Patient is participating in a conflicting study.

The above is a clinical trial exclusion criterion. Annotated with entity spans:
[Competing_trial: Patient is participating in a conflicting study].